Clinical trial exclusion criterion:
Thrombosis in left atrium;

Annotated entities:
- Condition: "Thrombosis"
- Qualifier: "left atrium"